Clinical trial inclusion criterion:
For healthy individuals: Healthy, without allergies and with the age of 18 years or above.

Annotated entities:
- Condition: "Healthy"
- Condition: "healthy"
- Negation: "without"
- Condition: "allergies"
- Value: "18 years or above"
- Person: "age"